Clinical trial inclusion criteria:
Horner's Syndrome
History of taking an alpha blocker (tamsulosin/ terazosin/doxazosin/alfuzosin/silodosin) medication

Annotated entities:
- Condition: "Horner's Syndrome"
- Drug: "alpha blocker"
- Drug: "tamsulosin"
- Drug: "terazosin"
- Drug: "doxazosin"
- Drug: "alfuzosin"
- Drug: "silodosin"